40-120 kg, inclusive

The above is a clinical trial inclusion criterion. Annotated with entity spans:
[Value: 40-120] [Person: kg], inclusive